Clinical trial exclusion criteria:
Patients refuse to follow the research
Patient has had previous eradication therapy of Helicobacter pylori infection.
The patient is pregnant or breastfeeding
Patients have a history of allergy to one component of triple therapy regimen (proton pump inhibitor, penicillin, and / or macrolide) before.
Patients are known to have impaired liver function, evidenced by ALT values within normal limits, and no previous liver disease.
Patients were found to have arrhythmias or obtained QT wave elongation on electrocardiographic

Annotated entities:
- Observation: "refuse to follow the research"
- Temporal: "previous"
- Procedure: "eradication therapy"
- Condition: "Helicobacter pylori infection"
- Condition: "pregnant"
- Observation: "breastfeeding"
- Temporal: "history"
- Condition: "allergy"
- Drug: "component of triple therapy regimen"
- Drug: "proton pump inhibitor"
- Drug: "penicillin"
- Drug: "macrolide"
- Value: "impaired"
- Measurement: "liver function"
- Measurement: "ALT values"
- Value: "within normal limits"
- Negation: "no"
- Temporal: "previous"
- Condition: "liver disease"
- Condition: "arrhythmias"
- Condition: "QT wave elongation"
- Procedure: "electrocardiographic"